Clinical trial inclusion criterion:
WHO (World Health organization) Performance status: 0, 1 or 2

Annotated entities:
- Measurement: "WHO (World Health organization) Performance status"
- Value: "0, 1 or 2"